Cancer, with no active treatment in the last year

The above is a clinical trial inclusion criterion. Annotated with entity spans:
[Condition: Cancer], with [Negation: no] [Procedure: active treatment] [Temporal: in the last year]